Previous pars plana vitrectomy in the study eye

The above is a clinical trial exclusion criterion. Annotated with entity spans:
[Temporal: Previous] [Procedure: pars plana vitrectomy] [Qualifier: in the study eye]